Clinical trial exclusion criterion:
Subjects who have asthma

Annotated entities:
- Condition: "asthma"